En una reacción de orden cero:
1. La velocidad de la reacción es independiente de la concentración de reactivos.
2. La velocidad de reacción siempre depende de la concentración de uno de los reactivos.
3. La representación gráfica de la concentración frente al tiempo es una recta cuya pendiente es 1/k.
4. La unidad de la constante de velocidad es la inversa de tiempo (t-1).

Respuesta correcta: 1. La velocidad de la reacción es independiente de la concentración de reactivos.